在腹腔鏡手術置入側邊套管（trocar）時，常因為套管位置太接近身體中線而傷到血管，而造成腹壁出血和 血腫，則最有可能傷到的血管是：
A. 表淺迴旋動脈（superficial circumflex artery）
B. 胃左動脈（left gastric artery）
C. 表淺外陰部動脈（superficial external pudendal artery）
D. 下腹壁動脈（inferior epigastric artery）

正確答案：D. 下腹壁動脈（inferior epigastric artery）